Clinical trial exclusion criterion:
Renal biopsy showing cellular or fibrocellular crescent in more than 25% of glomeruli.

Entity relations:
- Has_multiplier("cellular crescent", "more than 25% of glomeruli")
- AND("Renal biopsy", "cellular crescent")
- OR("cellular crescent", "fibrocellular crescent")